Clinical trial exclusion criterion:
2. Recent (< 3 months) acute macrovascular event e.g. acute coronary syndrome or cardiac surgery.

Entity relations:
- Subsumes("Recent", "< 3 months")
- Subsumes("acute macrovascular event", "acute coronary syndrome")
- Has_temporal("acute macrovascular event", "Recent")
- OR("acute coronary syndrome", "cardiac surgery")